Clinical trial exclusion criterion:
Self reported current or chronic narcotic use (typical daily use)

Annotated entities:
- Qualifier: "Self reported"
- Temporal: "current"
- Qualifier: "chronic"
- Condition: "narcotic use"
- Multiplier: "daily use"